Is a prisoner

The above is a clinical trial exclusion criterion. Annotated with entity spans:
Is a [Person: prisoner]